Un potencial receptor:
1. Se produce por la apertura de canales dependientes de voltaje.
2. Aumenta su frecuencia si aumenta la intensidad del estímulo.
3. Se produce tras la unión del neurotransmisor al receptor postsinático.
4. Se producen si se supera el umbral de disparo.
5. Puede ser excitador o inhibidor.

Respuesta correcta: 5. Puede ser excitador o inhibidor.